Clinical trial exclusion criterion:
Patients with a history of any other malignancy.

Annotated entities:
- Condition: "malignancy"
- Qualifier: "any other"
- Temporal: "history"